Señale cuál de las manifestaciones o subtipos clínicos es más frecuente en el caso de trastorno obsesivo compulsivo:
1. Las compulsiones de comprobación.
2. La lentitud obsesiva (realizar actividades como vestirse o ducharse de forma obsesivamente pausada).
3. Las compulsiones de limpieza/lavado.
4. Las compulsiones de tocar (por ejemplo, todas las esquinas).
5. Las compulsiones referidas a la religión (especialmente rezar).

Respuesta correcta: 3. Las compulsiones de limpieza/lavado.